Clinical trial inclusion criterion:
Acutely ill hospitalised children

Annotated entities:
- Condition: "Acutely ill"
- Observation: "hospitalised"
- Person: "children"